有關肺臟的表面活性劑（surfactant）的敘述，下列何者正確？
A. 由呼吸性細支氣管（respiratory bronchiole）所分泌
B. 糖皮質素（glucocorticoid）會促進胎兒在出生前肺內表面活性劑的產生
C. 其在小肺泡（alveolus）內的密度遠比大肺泡內低
D. 能增加肺泡（alveolus）的彈性回復力（elastic recoil）

正確答案：B. 糖皮質素（glucocorticoid）會促進胎兒在出生前肺內表面活性劑的產生